Clinical trial inclusion criteria:
Adult patients scheduled for arthroscopic knee ligament reconstruction

Annotated entities:
- Person: "Adult"
- Mood: "scheduled"
- Procedure: "arthroscopic knee ligament reconstruction"